在正常情況下，決定腎絲球濾過率（GFR）的史氏力量（Starling forces）中，絕對值最大的為何？
A. 腎絲球微血管內血漿的膠性滲透壓（ΠGC）
B. 腎絲球微血管內的壓力（PGC）
C. 鮑氏囊中的壓力（PBS）
D. 鮑氏囊中腎絲球濾過液的膠性滲透壓（ΠBS）

正確答案：B. 腎絲球微血管內的壓力（PGC）